Clinical trial exclusion criterion:
Body weight <50 or >120 kg

Entity relations:
- Has_value("Body weight", "<50 kg")
- OR("<50 kg", ">120 kg")